Clinical trial inclusion criteria:
Controlled hypertension: systolic BP < 150 and diastolic BP < 90 mmHg in persons aged 60 years or older, systolic BP < 140 and diastolic BP < 90 mmHg in persons 40 through 59 years according to the JNC 8th guideline
Evidence of diastolic dysfunction showing E/E' > 10
The patient agrees to the study protocol and the schedule of clinical and echocardiographic follow-up, and provides informed, written consent, as approved by the appropriate Institutional Review Board/Ethical Committee of the respective clinical site

Annotated entities:
- Condition: "hypertension"
- Qualifier: "Controlled"
- Measurement: "systolic BP"
- Value: "< 150"
- Measurement: "diastolic BP"
- Value: "< 90 mmHg"
- Person: "aged"
- Value: "60 years or older"
- Measurement: "systolic BP"
- Value: "< 140"
- Measurement: "diastolic BP"
- Value: "< 90 mmHg"
- Person: "years"
- Value: "40 through 59"
- Qualifier: "JNC 8th guideline"
- Condition: "diastolic dysfunction"
- Measurement: "E/E'"
- Value: "> 10"
- Post-eligibility: "The patient agrees to the study protocol and the schedule of clinical and echocardiographic follow-up, and provides informed, written consent, as approved by the appropriate Institutional Review Board/Ethical Committee of the respective clinical site"